History of hypersensitivity for bevacizumab.

The above is a clinical trial exclusion criterion. Annotated with entity spans:
[Temporal: History] of [Condition: hypersensitivity] for [Drug: bevacizumab].